Has been diagnosed with Glucose-6-phosphate dehydrogenase deficiency or methemoglobin reductase deficiency

The above is a clinical trial exclusion criterion. Annotated with entity spans:
Has been diagnosed with [Condition: Glucose-6-phosphate dehydrogenase deficiency] or [Condition: methemoglobin reductase deficiency]